13. attempt of suicide in the last 2 years or at suicidal risk assessed by SCID interview;

The above is a clinical trial exclusion criterion. Annotated with entity spans:
[Parsing_Error: 13.] [Condition: attempt of suicide] [Temporal: in the last 2 years] or [Condition: at suicidal risk] assessed by [Procedure: SCID interview];